Clinical trial inclusion criterion:
Age greater than 18

Entity relations:
- Has_value("Age", "greater than 18")